Positive Anti-Mitochondrial Antibodies (AMA) titers (>1/40 on immunofluorescence or M2 positive by enzyme linked immunosorbent assay (ELISA) or positive PBC-specific antinuclear antibodies

The above is a clinical trial inclusion criterion. Annotated with entity spans:
[Measurement: Positive Anti-Mitochondrial Antibodies (AMA) titers] ([Value: >1/40] on [Measurement: immunofluorescence] or [Value: M2 positive] by [Measurement: enzyme linked immunosorbent assay (ELISA)] or [Value: positive] [Measurement: PBC-specific antinuclear antibodies]